一位 28 歲男性，騎機車未戴安全帽，車禍致頭部外傷送至急診，來院時電腦斷層顯示左側顳葉微量腦挫傷出血，昏迷指數為 14 分，經住院施與降腦壓等藥物治療後逐漸恢復意識，2 週後出院。不幸 個月後，患者左眼突出合併結膜充血，並聽到顱內不正常聲響，則下列那一診斷正確？
A. 外傷性動靜脈　管（Traumatic AV fistula at the transverse sinus）
B. 外傷性內頸動脈海綿竇　管（Traumatic Carotid-Cavernous fistula）
C. 大腦皮質動靜脈　管（Cortical artery and venous fistula）
D. 外傷性顱內動脈瘤（Traumatic intracranial aneurysm）

正確答案：B. 外傷性內頸動脈海綿竇　管（Traumatic Carotid-Cavernous fistula）